Perinephritic abscess

The above is a clinical trial exclusion criterion. Annotated with entity spans:
[Condition: Perinephritic abscess]